Hypotension (Systolic blood pressure <100 mmHg)

The above is a clinical trial exclusion criterion. Annotated with entity spans:
[Condition: Hypotension] ([Measurement: Systolic blood pressure] [Value: <100 mmHg])